Accepting to participate in the study

The above is a clinical trial inclusion criterion. Annotated with entity spans:
A[Post-eligibility: ccepting to participate in the study]